一位右耳正常，但左耳罹患慢性中耳炎（氣骨導差值為 30 dB）的病人，給予進行音叉測驗，結果可見：
A. 左耳 Rinne test 呈陽性，Weber test 朝向右側
B. 左耳 Rinne test 呈陽性，Weber test 朝向左側
C. 左耳 Rinne test 呈陰性，Weber test 朝向右側
D. 左耳 Rinne test 呈陰性，Weber test 朝向左側

正確答案：D. 左耳 Rinne test 呈陰性，Weber test 朝向左側